Acute disease at the time of enrolment

The above is a clinical trial exclusion criterion. Annotated with entity spans:
[Condition: Acute disease] [Temporal: at the time of enrolment]